Clinical trial exclusion criterion:
Patients with cardiac disease or using anti-arrhythmic agents

Annotated entities:
- Drug: "anti-arrhythmic agents"
- Condition: "cardiac disease"